對兒童幽門螺旋桿菌感染，目前所建議的三合一治療（triple therapy）必包括下列何種藥物？
A. Aminoglycosides
B. Beta-lactams
C. Histamine blockers
D. Proton pump inhibitors

正確答案：D. Proton pump inhibitors